Clinical trial inclusion criterion:
Age 18 to 75 years old (male or female).

Annotated entities:
- Person: "Age"
- Value: "18 to 75 years old"
- Person: "male"
- Person: "female"